What disease is associated with Anticitrullinated peptide antibodies (ACPAs)?

Anticitrullinated peptide antibodies (ACPAs) have been shown to be associated with rheumatoid arthritis